Which is the conserved motif of DEAD box proteins?

The conserved motif is: Asp(D)-Glu-(E)-Ala(A)-Asp(D)